Clinical trial exclusion criterion:
Preoperative radio- or chemotherapy;

Entity relations:
- Has_temporal("chemotherapy", "Preoperative")
- OR("chemotherapy", "therapy radio")